Señale cuál de los siguientes es más claramente un síntoma positivo de la esquizofrenia:
1. El afecto plano o embotado.
2. La pobreza del lenguaje.
3. La asociabilidad.
4. Las alucinaciones.
5. La bulimia.

Respuesta correcta: 4. Las alucinaciones.